El autotratamiento es una forma de respuesta de las personas ante los síntomas de enfermedad. Indique la respuesta INCORRECTA:
1. El autotratamiento es la respuesta más habitual ante las situaciones de enfermedad.
2. El autotratamiento incluye medidas preventivas y el manejo de situaciones crónicas.
3. Consiste en conductas de salud y de enfermedad.
4. No implica la consulta a profesionales y la utilización de sus servicios.

Respuesta correcta: 4. No implica la consulta a profesionales y la utilización de sus servicios.